一位 5 歲神經學檢查均正常的女孩，過去 3 年內曾有兩次因上呼吸道感染發燒併發全身性僵直陣攣發作（generalized tonic-clonic seizure），每次發作都在 1 分鐘之內結束。下列敘述何者錯誤？
A. 最可能的診斷為熱性痙攣（febrile seizure）
B. 有強烈之遺傳傾向（strong inheritance tendency）
C. 其平常無發燒期間之特徵性腦電圖（EEG）表現為局部顳葉棘波（temporal spike）
D. 陣攣發作通常發生於發燒攝氏 38 度以上

正確答案：C. 其平常無發燒期間之特徵性腦電圖（EEG）表現為局部顳葉棘波（temporal spike）